一位40歲男性在車禍中受傷被送急診，當時意識清醒，但有大量的血尿，經靜脈給予兩公升的Crystalloid並輸血，腹部斷層掃描（CT scan）顯示左側腎臟撕裂傷合併巨大血腫，病人的血壓一直維持在70/40 mmHg無法再上升，下一步要作的處置為何？
A. 腎臟血管造影
B. 施行經皮腎造瘻術（percutaneous nephrostomy）
C. 緊急手術
D. 照KUB

正確答案：C. 緊急手術